Clinical trial inclusion criterion:
Uni-dimensionally measurable disease according to Response Evaluation Criteria in Solid Tumours (RECIST) v1.1

Entity relations:
- AND("disease", "Response Evaluation Criteria in Solid Tumours (RECIST) v1.1")
- Has_value("Response Evaluation Criteria in Solid Tumours (RECIST) v1.1", "Uni-dimensionally measurable")